Medical history of hypersensitivity to the components of the investigational products. (The components of test drug 1 and 2, including the Rhein-based drug)

The above is a clinical trial exclusion criterion. Annotated with entity spans:
Medical history of [Condition: hypersensitivity] to the [Drug: components of the investigational products]. (The [Drug: components of test drug 1] and 2, including the [Drug: Rhein-based drug])